下列何者在小腿沒有血管伴行？
A. 腓腸神經（sural nerve）
B. 腓深神經（deep fibular nerve）
C. 腓淺神經（superficial  fibular  nerve）
D. 脛神經（tibial nerve）

正確答案：C. 腓淺神經（superficial  fibular  nerve）